Informed consent as documented by signature (see informed consent form)

The above is a clinical trial inclusion criterion. Annotated with entity spans:
[Post-eligibility: Informed consent as documented by signature (see informed consent form)]